下列何種腎絲球病變和 HIV（human immunodeficiency virus）感染最有關聯？
A. Crescentic glomerulonephritis
B. Focal segmental glomerulosclerosis
C. Glomerular nodular sclerosis
D. Thrombotic microangiopathy

正確答案：B. Focal segmental glomerulosclerosis